¿Cómo se denomina el efecto que forma parte de la acción farmacológica, pero cuya aparición resulta indeseable y suele manifestarse en otro órgano o sistema?:
1. Efecto secundario.
2. Efecto colateral.
3. Reacción idiosincrásica.
4. Efecto rebote.

Respuesta correcta: 2. Efecto colateral.